failure to advance the IVUS catheter through the culprit lesion;

The above is a clinical trial exclusion criterion. Annotated with entity spans:
[Qualifier: failure] to [Procedure: advance the IVUS catheter] through the [Qualifier: culprit lesion];